5. Has a known adverse reaction and/or sensitivity to the study drug or its components.

The above is a clinical trial exclusion criterion. Annotated with entity spans:
[Parsing_Error: 5.] Has a known [Condition: adverse reaction] and/or [Condition: sensitivity to the study drug or its components].